Clinical trial inclusion criterion:
The second early induction start criteria is in addition to the listed above, the percentage of the blasts on the level >10% on 7th day.

Entity relations:
- Has_value("percentage of the blasts", ">10%")
- Has_temporal("percentage of the blasts", "on 7th day")